La epidemiología de la esquizofrenia refleja que:
1. El 0,1 % de la población general padece dicho trastorno y que dicho porcentaje se incrementa en un 50 % entre los familiares de primer grado afectados por esquizofrenia.
2. El 1% de la población general padece dicho trastorno y que dicho porcentaje se incrementa en un 10% entre los familiares de primer grado afectados por esquizofrenia.
3. El 3% de la población general está afectada por dicho trastorno sin estar influenciada por familiares que lo padezcan.
4. El 5% de la población general está afectada por dicho trastorno sin estar influenciada por familiares que lo padezcan.
5. La epidemiología varía entre el 5% y el 10% según culturas.

Respuesta correcta: 2. El 1% de la población general padece dicho trastorno y que dicho porcentaje se incrementa en un 10% entre los familiares de primer grado afectados por esquizofrenia.